Chronic hepatitis B (HBsAg positive > 6 months)

The above is a clinical trial inclusion criterion. Annotated with entity spans:
[Condition: Chronic hepatitis B] ([Measurement: HBsAg] [Value: positive] [Temporal: > 6 months])